Clinical trial exclusion criterion:
Secondary hypertension, including SAS, PA, RAS, pheochromocytoma, Cushing's syndrome, aorta diseases, drug induced hypertension;

Annotated entities:
- Condition: "Secondary hypertension"
- Condition: "SAS"
- Condition: "PA"
- Condition: "RAS"
- Condition: "pheochromocytoma"
- Condition: "Cushing's syndrome"
- Condition: "aorta diseases"
- Condition: "hypertension"
- Qualifier: "drug induced"